Clinical trial inclusion criterion:
1. Subject has a history of GTC seizures, either primary GTC or partial onset seizures with secondary generalization.

Annotated entities:
- Parsing_Error: "1."
- Condition: "GTC seizures"
- Condition: "primary GTC"
- Condition: "partial onset seizures"
- Condition: "secondary generalization"
- Temporal: "history"